Clinical trial exclusion criterion:
Hemoglobin > 12g/dL

Annotated entities:
- Measurement: "Hemoglobin"
- Value: "> 12g/dL"